En un hombre de 60 años, con una moderada insuficiencia renal, se inicia el tratamiento, sin administración de dosis de carga, con un medicamento digitálico. En estas condiciones, la semivida o vida media plasmática del digitálico se estima en 72 horas. Señale cuanto tiempo de tratamiento en días debe transcurrir desde el inicio del tratamiento para que se alcance la concentración de equilibrio o concentración media en estado estacionario.
1. En 3 días.
2. Entre 3 y 9 días.
3. Entre 12 y 15 días.
4. Más de 30 días.
5. Más de 60 días.

Respuesta correcta: 3. Entre 12 y 15 días.